Clinical trial exclusion criterion:
In an emergency setting, or hospitalized involuntarily

Annotated entities:
- Visit: "emergency setting"
- Procedure: "hospitalized"
- Qualifier: "involuntarily"
- Condition: "hospitalized involuntarily"